Clinical trial inclusion criterion:
Patients both sexes

Annotated entities:
- Person: "both sexes"